Clinical trial inclusion criterion:
Written informed consent and/or, written informed assent as required

Entity relations:
- OR("Written informed consent", "written informed assent")